¿En qué tipo de puntuaciones se encuentra baremado el Cuestionario Multifásico de Evaluación de la Personalidad de Minnesota para que nos pueda permitir elaborar un juicio diagnóstico?
1. En puntuaciones Tasa Base (TB).
2. En Puntuaciones Estándar (S).
3. En puntuaciones percentiles.
4. En puntuaciones directas.
5. En puntuaciones típicas “T”.

Respuesta correcta: 5. En puntuaciones típicas “T”.